Clinical trial inclusion criterion:
scheduled for Nuss procedure for pectus excavatum correction

Entity relations:
- AND("Nuss procedure", "pectus excavatum")
- Has_mood("Nuss procedure", "scheduled")